List the two most important synaptic markers.

postsynaptic density 95
synaptophysin